Clinical trial inclusion criterion:
ability to fill the Finnish versions of questionnaires.

Annotated entities:
- Non-query-able: "ability to fill the Finnish versions of questionnaires."